Clinical trial exclusion criteria:
Progressive, unstable or uncontrolled clinical conditions.
Hypersensitivity, including allergy, to any component of vaccines, medicinal products or medical equipment whose use is foreseen in this study.
Clinical conditions representing a contraindication to intramuscular vaccination and blood draws.
Clinical conditions.
Systemic administration of corticosteroids (PO/IV/IM) within 90 days prior to informed consent.
Administration of antineoplastic and immunomodulating agents or radiotherapy within 90 days prior to informed consent.
Received immunoglobulins or any blood products within 180 days prior to informed consent.
Received an investigational or non-registered medicinal product within 30 days prior to informed consent.
Any other clinical condition that, in the opinion of the investigator, might pose additional risk to the subject due to participation in the study.
Any history of meningococcal vaccination or meningococcal and gonorrhoea diseases.
Enrolment in any activity requiring a blood donation greater than 50 mL during the period starting 30 days before the first study visit (Day -83, Day -60 or Day -30) or for the duration of the study period.
Administration of long-acting immune-modifying drugs at any time during the study period
Subjects with blood disorders.
Subjects with a history of difficulty in providing blood samples
Any antibiotic intake 7 days prior to blood collection.
Subjects who donated >450 mL of blood within 60 days prior to any blood collection visits.
Subjects who lost >200 mL during a single apheresis or who lost red blood cells on more than one occasion during apheresis within the previous 60 days.
Concurrently participating in another clinical study, at any time during the study period, in which the subject has been or will be exposed to an investigational or a non-investigational vaccine/product
Ongoing anaemia as indicated by haemoglobin values below the lower limit of the laboratory-specified reference range. If the finger prick method demonstrates an anaemia, no further protocol procedures will be performed, and the subject will be referred for appropriate medical management. The subject may participate in this study following therapy and evidence that the anaemia has been resolved.
History of any reaction or hypersensitivity likely to be exacerbated by any component of the vaccines.
Pregnant or lactating female.
Female planning to become pregnant or planning to discontinue contraceptive precautions.
Any confirmed or suspected immunosuppressive or immunodeficiency condition based on medical history and physical examination
Family history of congenital or hereditary immunodeficiency.
Serious chronic illness.
History of chronic alcohol consumption and/or drug abuse.

Annotated entities:
- Qualifier: "uncontrolled"
- Qualifier: "unstable"
- Qualifier: "Progressive"
- Condition: "clinical conditions"
- Condition: "Hypersensitivity"
- Condition: "allergy"
- Drug: "component of vaccines"
- Drug: "medicinal products"
- Device: "medical equipment"
- Qualifier: "whose use is foreseen in this study"
- Condition: "contraindication"
- Procedure: "intramuscular vaccination"
- Procedure: "blood draws"
- Non-representable: "Clinical conditions."
- Qualifier: "Systemic administration"
- Drug: "corticosteroids"
- Qualifier: "PO"
- Qualifier: "IV"
- Qualifier: "IM"
- Temporal: "within 90 days prior to informed consent"
- Reference_point: "informed consent"
- Drug: "immunomodulating agents"
- Drug: "antineoplastic agents"
- Procedure: "radiotherapy"
- Temporal: "within 90 days prior to informed consent"
- Reference_point: "informed consent"
- Drug: "immunoglobulins"
- Drug: "blood products"
- Temporal: "within 180 days prior to informed consent"
- Reference_point: "informed consent"
- Qualifier: "investigational"
- Qualifier: "non-registered"
- Drug: "medicinal product"
- Temporal: "within 30 days prior to informed consent"
- Reference_point: "informed consent"
- Non-representable: "Any other clinical condition that, in the opinion of the investigator, might pose additional risk to the subject due to participation in the study."
- Drug: "meningococcal vaccination"
- Temporal: "history"
- Condition: "meningococcal diseases"
- Condition: "gonorrhoea diseases"
- Procedure: "blood donation"
- Non-representable: "Enrolment in any activity requiring a"
- Multiplier: "greater than 50 mL"
- Temporal: "during the period starting 30 days before the first study visit"
- Reference_point: "30 days before the first study visit"
- Temporal: "for the duration of the study period"
- Reference_point: "the study period"
- Drug: "immune-modifying drugs"
- Temporal: "at any time during the study period"
- Reference_point: "the study period"
- Qualifier: "long-acting"
- Condition: "blood disorders"
- Temporal: "history"
- Observation: "difficulty in providing blood samples"
- Drug: "antibiotic"
- Temporal: "7 days prior to blood collection"
- Reference_point: "blood collection"
- Procedure: "donated blood"
- Value: ">450 mL"
- Temporal: "within 60 days prior to any blood collection visits"
- Reference_point: "any blood collection visits"
- Measurement: "lost red blood cells"
- Value: ">200 mL"
- Multiplier: "single"
- Procedure: "apheresis"
- Procedure: "apheresis"
- Multiplier: "more than one occasion"
- Temporal: "within the previous 60 days"
- Reference_point: "the previous 60 days"
- Temporal: "Concurrently"
- Observation: "participating in clinical study"
- Temporal: "at any time during the study period"
- Reference_point: "the study period"
- Drug: "vaccine"
- Drug: "product"
- Qualifier: "investigational"
- Qualifier: "non-investigational"
- Temporal: "Ongoing"
- Condition: "anaemia"
- Measurement: "haemoglobin"
- Value: "below the lower limit of the laboratory-specified reference range"
- Procedure: "finger prick method"
- Condition: "anaemia"
- Non-representable: "and the subject will be referred for appropriate medical management. The subject may participate in this study following therapy and evidence that the anaemia has been resolved."
- Condition: "reaction"
- Condition: "hypersensitivity"
- Qualifier: "likely to be exacerbated by any component of the vaccines"
- Drug: "component of the vaccines"
- Condition: "Pregnant"
- Observation: "lactating"
- Person: "female"
- Person: "Female"
- Mood: "planning to become pregnant"
- Mood: "planning to discontinue"
- Observation: "contraceptive precautions"
- Mood: "planning to"
- Observation: "become pregnant"
- Qualifier: "confirmed"
- Mood: "suspected"
- Condition: "immunosuppressive condition"
- Condition: "immunodeficiency condition"
- Temporal: "medical history"
- Procedure: "physical examination"
- Observation: "Family history"
- Condition: "hereditary immunodeficiency"
- Condition: "congenital immunodeficiency"
- Qualifier: "Serious"
- Condition: "chronic illness"
- Condition: "chronic alcohol consumption"
- Condition: "drug abuse"
- Temporal: "History"